Clinical trial exclusion criterion:
History of any skin-related cancer

Annotated entities:
- Condition: "skin-related cancer"
- Temporal: "History"